¿Cuál de las siguientes lesiones traumáticas precisa, para evitar complicaciones locales, un tratamiento más precoz?
1. Luxación traumática posterior de la cadera.
2. Fractura desplazada del cuello femoral del anciano.
3. Fractura trocantérea del anciano.
4. Fractura de cotilo.
5. Fractura subtrocantérea.

Respuesta correcta: 1. Luxación traumática posterior de la cadera.